Clinical trial exclusion criteria:
Unstable medical disease of comorbid psychiatric disease
Dementia
Subjects with less than one year duration of Parkinson's
Current treatment with a dopamine agonist

Annotated entities:
- Condition: "Unstable medical disease"
- Condition: "comorbid psychiatric disease"
- Condition: "Dementia"
- Multiplier: "less than one year duration"
- Condition: "Parkinson's"
- Drug: "dopamine agonist"
- Temporal: "Current"